Clinical trial inclusion criterion:
treatment-naive patients with B-cell lymphoma

Annotated entities:
- Condition: "treatment"
- Condition: "B-cell lymphoma"
- Negation: "naive"